Clinical trial exclusion criterion:
Patient unwilling to accept a pump

Entity relations:
- Has_mood("pump", "unwilling to accept")